Clinical trial inclusion criterion:
Agrees to wear a head mounted display (HMD) for up to 45 minutes

Annotated entities:
- Observation: "Agrees to wear"
- Device: "head mounted display (HMD)"
- Temporal: "for up to 45 minutes"